Clinical trial exclusion criterion:
Hemoglobin less than 7.0 gms even if receiving erythropoietin.

Entity relations:
- Has_value("Hemoglobin", "less than 7.0 gms")
- Has_qualifier("less than 7.0 gms", "even if receiving erythropoietin")